Clinical trial exclusion criterion:
History of chronic obstructive pulmonary disease or cor pulmonale, or substantially decreased respiratory reserve, hypoxia, hypercapnia or pre-existing respiratory depression

Annotated entities:
- Condition: "chronic obstructive pulmonary disease"
- Condition: "cor pulmonale,"
- Condition: "decreased respiratory reserve"
- Condition: "hypoxia"
- Condition: "hypercapnia"
- Condition: "respiratory depression"